Clinical trial exclusion criterion:
previous thoracic surgery

Entity relations:
- Has_temporal("thoracic surgery", "previous")